Clinical trial exclusion criterion:
Prior treatment with CPAP.

Annotated entities:
- Procedure: "CPAP"
- Temporal: "Prior"